Clinical trial exclusion criterion:
Previous history of chemical dependence

Entity relations:
- Has_temporal("chemical dependence", "history")
- Has_temporal("chemical dependence", "Previous")